Describe ReactomeGSA

ReactomeGSA is a new pathway analysis tool integrated into the Reactome ecosystem. Its main feature is that it performs quantitative pathway analyses (so-called gene set analyses). This increases the statistical power of the differential expression analysis, which is directly performed on the pathway level.